Systolic blood pressure outside the range of 100-160 mmHg or diastolic blood pressure above 95 mmHg at Screening

The above is a clinical trial exclusion criterion. Annotated with entity spans:
[Measurement: Systolic blood pressure] [Value: outside the range of 100-160 mmHg] or [Measurement: diastolic blood pressure] [Value: above 95 mmHg] [Temporal: at Screening]